45歲男性，5年前接受右側第四、五腰椎椎間盤突出切除手術，近一個月來，右側坐骨神經痛復發。初步診斷為椎間盤突出復發或硬膜上神經粘黏。下列何項檢查，最能區別此兩者？
A. 電腦斷層加顯影劑檢查（computed tomography with contrast enhancement）
B. 電腦斷層加椎間盤造影檢查（computed tomographic discography）
C. 電腦斷層加脊髓造影檢查（computed tomographic myelography）
D. 磁振造影加顯影劑檢查（magnetic resonance imaging with gadolinium）

正確答案：D. 磁振造影加顯影劑檢查（magnetic resonance imaging with gadolinium）